What is the ChIP-exo method used for?

ChIP-exo method for identifying genomic location of DNA-binding proteins with near-single-nucleotide accuracy.